Clinical trial inclusion criterion:
Menopausal women with breast cancer treated and using tamoxifen or aromatase inhibitor.

Annotated entities:
- Condition: "Menopausal"
- Person: "women"
- Condition: "breast cancer"
- Procedure: "treated"
- Drug: "tamoxifen"
- Drug: "aromatase inhibitor"